1. Are referred to the Cachexia Clinic with involuntary weight loss of >5% of their premorbid weight within the previous 6 months.

The above is a clinical trial inclusion criterion. Annotated with entity spans:
1. Are referred to the [Visit: Cachexia Clinic] with [Condition: involuntary weight loss] of [Value: >5% of their premorbid weight] [Temporal: within the previous 6 months].